Clinical trial exclusion criterion:
Can not obtain the child's parental consent

Annotated entities:
- Negation: "not"
- Observation: "child's parental consent"
- Informed_consent: "Can not obtain the child's parental consent"